2. CEAP Classification Stage 6

The above is a clinical trial inclusion criterion. Annotated with entity spans:
[Parsing_Error: 2.] [Measurement: CEAP Classification] [Value: Stage 6]